Clinical trial exclusion criterion:
Left ventricular ejection fraction <45%

Annotated entities:
- Measurement: "Left ventricular ejection fraction"
- Value: "<45%"